Clinical trial inclusion criterion:
Patients who are on Tacrolimus immunosuppressive therapy twice a day for at least two weeks.

Annotated entities:
- Drug: "Tacrolimus"
- Multiplier: "twice a day"
- Temporal: "at least two weeks"